Clinical trial inclusion criterion:
2) stroke within the past 6 to 60 months,

Annotated entities:
- Condition: "stroke"
- Temporal: "within the past 6 to 60 months"
- Parsing_Error: "2)"